Clinical trial exclusion criterion:
Severely elevated serum BNP defined as BNP>300pg/ml

Entity relations:
- Has_value("serum BNP", "Severely elevated")
- Has_value("BNP", ">300pg/ml")
- Subsumes("serum BNP", "BNP")